Clinical trial exclusion criterion:
Use of Belviq XR within 6 months before Screening or hypersensitivity to Belviq XR or any of the excipients

Annotated entities:
- Drug: "Belviq XR"
- Temporal: "within 6 months before Screening"
- Reference_point: "Screening"
- Condition: "hypersensitivity"
- Drug: "Belviq XR"
- Qualifier: "or any of the excipients"